有關乳癌危險因子之敘述，下列何者錯誤？
A. 母親或姊妹曾患乳癌者，罹患危險性較高
B. 家族史或個人病史有子宮頸癌者，罹患危險性較高
C. 家族史或個人病史有卵巢癌者，罹患危險性較高
D. 初經早或停經晚者罹患危險性較高

正確答案：B. 家族史或個人病史有子宮頸癌者，罹患危險性較高